口服鐵製劑治療貧血，最常見之副作用為何？
A. 腸胃道刺激作用（GI tract irritation）
B. 低血鉀症（Hypokalemia）
C. 高血壓（Hypertension）
D. 頭痛（Headache）

正確答案：A. 腸胃道刺激作用（GI tract irritation）